Subjects with a concurrent Axis II Cluster A Personality Disorder

The above is a clinical trial exclusion criterion. Annotated with entity spans:
Subjects with a concurrent [Qualifier: Axis II Cluster A] [Condition: Personality Disorder]